La conversión de un grupo carbonilo en una amina a través de una imina intermedia se conoce como:
1. Aminación reductiva.
2. Reacción de Claisen.
3. Aminación alquilante.
4. Reacción de Wittig.

Respuesta correcta: 1. Aminación reductiva.